阻塞性睡眠呼吸中止症候群患者最常發生呼吸中止是在睡眠的那一個時期？
A. 非快速動眼期（non-REM）stage 1
B. 非快速動眼期 stage 2
C. 非快速動眼期 stage 3
D. 快速動眼期（REM）

正確答案：D. 快速動眼期（REM）